Clinical trial inclusion criterion:
Infrequently uses condoms during sex with 1 or more partners of unknown HIV status who are known to be at substantial risk of HIV infection (IDU or bisexual male partner)

Entity relations:
- Has_context("partners of unknown HIV status", "at substantial risk of HIV infection")
- Has_multiplier("partners of unknown HIV status", "1 or more")
- AND("Infrequently uses condoms during sex", "partners of unknown HIV status")
- OR("IDU", "bisexual male partner")